下列何者非子癲前症（pre-eclampsia）典型的臨床徵候？
A. 妊娠高血壓
B. 蛋白尿
C. 血糖上升
D. 下肢水腫

正確答案：C. 血糖上升